Clinical trial exclusion criterion:
Patient has known hypersensitivity to any of the components of the formulations used in the study.

Annotated entities:
- Condition: "hypersensitivity"
- Qualifier: "components of the formulations"